有關變異型庫賈氏病（variant Creutzfeldt-Jakob disease; vCJD）的描述，下列何者正確？
A. 通常發生此病之平均年齡為65歲
B. 常合併憂鬱，智能急速減退，及肌躍症
C. 平均存活時間比散發型庫賈氏病長
D. 大多數於腦脊髓液中會有14-3-3蛋白，且可測得普利昂（prion）蛋白

正確答案：C. 平均存活時間比散發型庫賈氏病長